Hepatosplenomegaly

The above is a clinical trial exclusion criterion. Annotated with entity spans:
[Condition: Hepatosplenomegaly]